下列有關乙醇（ethanol）的描述，何者錯誤？
A. 在乙醇吸收及分布相同的情況下，飲用相同量的酒精時，通常男性血中乙醇濃度會高於女性
B. 投與 benzodiazepines 的藥物可以緩解酒精的禁斷作用（withdrawal syndromes）
C. 乙醇經由肝臟代謝，會增加 NADH/NAD+的比值
D. 血漿中乙醇濃度超過 200 mg/dL（0.2%）時，走路會搖晃，不適合駕車

正確答案：A. 在乙醇吸收及分布相同的情況下，飲用相同量的酒精時，通常男性血中乙醇濃度會高於女性